La unión intercelular que abarca todo el perímetro celular es:
1. Unión ocluyente.
2. Desmosoma.
3. Hemidesmosoma.
4. Gap.

Respuesta correcta: 1. Unión ocluyente.